Clinical trial exclusion criterion:
With other respiratory diseases: such as active pulmonary tuberculosis, non-tuberculosis mycobacteria (NTM) pulmonary disease, pulmonary aspergillosis, etc.

Entity relations:
- Subsumes("non-tuberculosis mycobacteria pulmonary disease", "NTM")
- Has_qualifier("pulmonary tuberculosis", "active")
- Subsumes("respiratory diseases", "pulmonary tuberculosis")
- OR("pulmonary tuberculosis", "non-tuberculosis mycobacteria pulmonary disease", "pulmonary aspergillosis")